1. Comorbidity with other severe or chronic eye conditions that in the judgment of the investigator will interfere with study assessments, such as corneal opacities and scars, dystrophies, epithelial scarring, infections, blood clots, etc.

The above is a clinical trial exclusion criterion. Annotated with entity spans:
[Parsing_Error: 1.] Comorbidity with other severe or chronic [Condition: eye conditions] that [Subjective_judgement: in the judgment of the investigator] [Non-query-able: will interfere with study assessments], such as [Condition: corneal opacities] and scars, [Condition: dystrophies], [Condition: epithelial scarring], [Condition: infections], [Condition: blood clots], etc.